Treatment with levothyroxine must not be initiated in patients with acute myocardial infarction, acute myocarditis, or acute pancarditis.

The above is a clinical trial exclusion criterion. Annotated with entity spans:
[Procedure: Treatment] with [Drug: levothyroxine] must [Negation: not be initiated] in patients with [Condition: acute myocardial infarction], [Condition: acute myocarditis], or [Condition: acute pancarditis].